關於肺癌病人，下列何者有比較高的表皮生長因子受體基因變異（epidermal growth factor receptor mutation）？①女性 ②腺癌（adenocarcinoma） ③抽煙 ④亞洲人種 ⑤小細胞癌（small cell  carcinoma）
A. ①②③
B. ③④⑤
C. ①②④
D. ①②⑤

正確答案：C. ①②④